Patients must have a calculated serum creatinine clearance > 50 mL/min using Cockcroft-Gault calculation or based on 24-hour urine collection performed within 7 days prior to treatment.

The above is a clinical trial inclusion criterion. Annotated with entity spans:
Patients must have a calculated [Measurement: serum creatinine clearance] [Value: > 50 mL/min] using [Qualifier: Cockcroft-Gault calculation] or based on [Qualifier: 24-hour urine collection] performed [Temporal: within 7 days prior] to [Reference_point: treatment].